A Marta de 5 días le han realizado la prueba de Potenciales Evocados de Tronco Cerebral Automatizados antes de salir del hospital donde ha nacido ¿Qué tipo de prevención están realizando en esa actividad?:
1. Prevención Primaria.
2. Prevención Secundaria.
3. Prevención Terciaria.
4. Prevención Cuaternaria.

Respuesta correcta: 2. Prevención Secundaria.